En cromatografía de gases es muy común la derivatización, con varios objetivos. Uno de los que se comentan a continuación no está entre ellos:
1. Aumentar la volatilidad de compuestos no volátiles.
2. Evitar la descomposición de un compuesto, mejorando su estabilidad.
3. Reducir la absorción sobre superficies activas de las paredes de la columna y el soporte sólido.
4. Fragmentar el analito en iones moleculares de más fácil separación.
5. Mejorar la separación de compuestos estrechamente relacionados y que presentan una separación muy pobre.

Respuesta correcta: 4. Fragmentar el analito en iones moleculares de más fácil separación.